medications changing notably paracetamol (acetaminophen) and/or ropivacaine metabolism in regular use

The above is a clinical trial exclusion criterion. Annotated with entity spans:
medications changing notably [Drug: paracetamol] ([Drug: acetaminophen]) and/or [Drug: ropivacaine] metabolism in [Multiplier: regular use]